currently pregnant (positive pregnancy test), planning pregnancy, or lactating (women)

The above is a clinical trial exclusion criterion. Annotated with entity spans:
[Temporal: currently] [Condition: pregnant] ([Value: positive] [Measurement: pregnancy test]), [Mood: planning] [Condition: pregnancy], or [Condition: lactating] (women)